一位26歲男性病人發生腸道感染，下列何種情形不須使用抗微生物製劑治療？
A. nontyphoidal salmonellosis
B. giardiasis
C. 有發燒和血便現象之 traveler's diarrhea
D. 病人有發燒及糞便中很多白血球

正確答案：A. nontyphoidal salmonellosis